Clinical trial inclusion criteria:
A formal diagnosis of Autism or Pervasive Developmental Disorder not otherwise specified (PDD-NOS), given by a child neurologist.
Age: 10-18 years.
A signed parental consent form.

Annotated entities:
- Condition: "Autism"
- Condition: "Pervasive Developmental Disorder not otherwise specified"
- Condition: "PDD-NOS"
- Non-query-able: "given by a child neurologist"
- Person: "Age"
- Value: "10-18 years"
- Informed_consent: "A signed parental consent form"